關於傷口之二次癒合（secondary healing），下列敘述何者錯誤？
A. 傷口因收縮而變小
B. 肌纖維母細胞（myofibroblast）有參與癒合
C. 纖維母細胞（fibroblast）在受傷後第 7 天才開始出現在傷口
D. contaminated wound 多由此方式癒合

正確答案：C. 纖維母細胞（fibroblast）在受傷後第 7 天才開始出現在傷口